Clinical trial exclusion criterion:
9. History of malignancies related to the NK cell line, including: NK cell leukemias and T-cell large granular lymphocyte leukemias, NK-cell lymphoproliferative disease of granular lymphocytes, and NK cell lymphomas, e.g., nasal and nasal-like NK/T-cell lymphomas.

Entity relations:
- Subsumes("malignancies", "NK cell leukemias")
- Has_temporal("malignancies", "History")
- OR("NK cell leukemias", "nasal-like NK/T-cell lymphomas", "NK cell lymphomas", "NK-cell lymphoproliferative disease of granular lymphocytes", "T-cell large granular lymphocyte leukemias", "nasal NK/T-cell lymphomas")
- OR("malignancies", "related to the NK cell line")